Clinical trial inclusion criterion:
Age 2-17 years

Annotated entities:
- Person: "Age"
- Value: "2-17 years"